Clinical trial exclusion criterion:
Use of drugs known to increase the risk for cardiac valvulopathy within 6 months before Screening, including but not limited to pergolide, ergotamine, methysergide, and cabergoline

Entity relations:
- multi("known to increase the risk for cardiac valvulopathy", "cardiac valvulopathy")
- Has_qualifier("drugs", "known to increase the risk for cardiac valvulopathy")
- Subsumes("drugs", "pergolide")
- Has_temporal("drugs", "within 6 months before Screening")
- OR("pergolide", "cabergoline", "ergotamine", "methysergide")